Corneal staining < grade III on the Oxford scale

The above is a clinical trial inclusion criterion. Annotated with entity spans:
[Condition: Corneal staining] [Qualifier: < grade III] on the [Qualifier: Oxford scale]